known anemia (hemoglobin <10 g/dL) at the time of screening

The above is a clinical trial inclusion criterion. Annotated with entity spans:
known [Condition: anemia] ([Measurement: hemoglobin] [Value: <10 g/dL]) [Temporal: at the time of screening]